Clinical trial exclusion criterion:
Patients with active or suspected acute or chronic uncontrolled infection including abcesses or fistulae

Annotated entities:
- Condition: "uncontrolled infection"
- Condition: "abcesses"
- Condition: "fistulae"
- Qualifier: "active"
- Qualifier: "suspected"
- Qualifier: "acute"
- Qualifier: "chronic"